Clinical trial exclusion criterion:
Fetal demise

Annotated entities:
- Condition: "Fetal demise"